Sobre la síntesis de proteínas es correcto afirmar que:
1. Comienza por el extremo carboxilo.
2. El ARNm se traduce desde el extremo 5´ al 3´.
3. En eucariotas tiene lugar en el núcleo.
4. La primera subunidad del ribosoma en unirse al ARNm es la mayor.
5. No consume energía.

Respuesta correcta: 2. El ARNm se traduce desde el extremo 5´ al 3´.